The patient had a coronary stent for less than 12 months

The above is a clinical trial exclusion criterion. Annotated with entity spans:
The patient had a [Device: coronary stent] for [Temporal: less than 12 months]